Ocular surface or annexes metaplastic lesions

The above is a clinical trial exclusion criterion. Annotated with entity spans:
Ocular surface or [Condition: annexes metaplastic lesions]